Para que el autorregistro se convierta en una herramienta eficaz para la evaluación clínica ha de cumplir los requisitos de:
1. Tener un diseño completo que recoja cada una de las unidades significativas de una conducta compleja y su recuerdo.
2. Tener un diseño sencillo, sin sofisticación o complejidad, y siempre acompañado de un entrenamiento previo para su cumplimentación.
3. No limitar su cumplimentación a los hechos acaecidos en el momento sino también al recuerdo que se tiene de los mismos en momentos posteriores.
4. Abarcar todas y cada una de las conductas problemas identificadas por el cliente.
5. Ser cumplimentado por una persona significativa que conozca bien al cliente.

Respuesta correcta: 2. Tener un diseño sencillo, sin sofisticación o complejidad, y siempre acompañado de un entrenamiento previo para su cumplimentación.